What virus is the  Gardisil vaccine used for?

Gardisil is a quadrivalent HPV vaccine would have been useful in the prevention of infections with human papillomavirus.